Clinical trial inclusion criterion:
The presence of cycles until the age of 40 years with proven fertility, at least one child

Entity relations:
- Has_value("age", "until the age of 40 years")
- AND("presence of cycles", "age")